下列各種病毒性肝炎中，何者不能經由免疫接種來預防？
A. A 型
B. B 型
C. C 型
D. D 型

正確答案：C. C 型